Clinical trial inclusion criterion:
Chronic low back pain

Annotated entities:
- Condition: "Chronic low back pain"